Clinical trial exclusion criterion:
Clinical diagnosis associated with increased risk of bleeding including known active peptic ulceration and/or neoplasm with increased bleeding risk

Annotated entities:
- Observation: "risk of bleeding"
- Qualifier: "increased"
- Condition: "peptic ulceration"
- Qualifier: "active"
- Condition: "neoplasm"